Any previous treatment with sunitinib

The above is a clinical trial exclusion criterion. Annotated with entity spans:
Any previous treatment with [Drug: sunitinib]